Un varón afectado de asma bronquial está siendo sometido a un tratamiento crónico de varios años de duración con glucocorticoides. ¿Cuál de las siguientes reacciones adversas detectadas en dicho paciente no es debida al uso prolongado de terapia corticoidea?:
1. Cicatrización deficiente de las heridas.
2. Osteoporosis.
3. Hipotensión arterial.
4. Adelgazamiento de la piel.
5. Atrofia muscular.

Respuesta correcta: 3. Hipotensión arterial.